Describe Full Spectrum of Intolerance to Loss-of-function (FUSIL)

The FUSIL is the Full Spectrum of Intolerance to Loss-of-function (FUSIL). It's the full spectrum of genes that are not essential for cell survival, but essential for organism development.